Clinical trial inclusion criteria:
18 years or older
Chest radiograph showing new opacities.
Cough
Production of sputum
Temp >38,0 °C or <36,0 °C
Audible abnormalities by chest examination compatible with pneumonia
Leukocytosis (>10.000 cells/mm3), leftward shift (>10%) or leucopenia (<4000 cells/mm3)
C-reactive protein > 15 mg/l (three fold higher than the upper limit of normal)

Annotated entities:
- Person: "years"
- Value: "18 or older"
- Procedure: "Chest radiograph"
- Condition: "opacities"
- Qualifier: "new"
- Condition: "Cough"
- Condition: "sputum"
- Measurement: "Temp"
- Value: ">38,0 °C"
- Value: "<36,0 °C"
- Observation: "Audible abnormalities"
- Procedure: "chest examination"
- Condition: "pneumonia"
- Condition: "Leukocytosis"
- Multiplier: ">10.000 cells/mm3"
- Condition: "leucopenia"
- Multiplier: "<4000 cells/mm3"
- Multiplier: "leftward shift >10%"
- Measurement: "C-reactive protein"
- Value: "> 15 mg/l"
- Value: "three fold higher than the upper limit of normal"